下列何者不是預立醫囑倫理上的主要理由？
A. 確保病人自主受到尊重
B. 當醫療已無效時，增進病人生活品質及人性尊嚴
C. 節省醫療人員做醫療決定的時間
D. 減少家屬為當事者作生死決定時可能產生的焦慮、矛盾與內疚

正確答案：C. 節省醫療人員做醫療決定的時間